卵泡腔（antrum）首先出現於：
A. 原始卵泡（primordial follicle）
B. 初級卵泡（primary follicle）
C. 次級卵泡（secondary follicle）
D. 成熟卵泡（mature follicle）

正確答案：C. 次級卵泡（secondary follicle）